La teoría quimiosmótica:
1. Fue propuesta por Singer y Nicholson.
2. Explica el mecanismo de la fosforilación a nivel de sustrato.
3. Requiere que las membranas en las que se da formen compartimentos cerrados.
4. No explica la síntesis de ATP en la fotosíntesis.
5. No tiene nada que ver con las reacciones redox.

Respuesta correcta: 3. Requiere que las membranas en las que se da formen compartimentos cerrados.